Clinical trial exclusion criterion:
Prior anti-epidermal growth factor receptor (EGFr) antibody therapy (e.g., panitumumab or cetuximab) or treatment with small molecule EGFr inhibitors (e.g., gefitinib, erlotinib, lapatinib).

Annotated entities:
- Procedure: "anti-epidermal growth factor receptor antibody therapy"
- Drug: "panitumumab"
- Drug: "cetuximab"
- Procedure: "EGFr"
- Procedure: "treatment with small molecule EGFr inhibitors"
- Drug: "gefitinib"
- Drug: "erlotinib"
- Drug: "lapatinib"